patients with comorbidities (heart failure congestive, chronic obstructive pulmonary disease);

The above is a clinical trial exclusion criterion. Annotated with entity spans:
patients with [Condition: comorbidities] ([Condition: heart failure congestive], [Condition: chronic obstructive pulmonary disease]);